金黃色葡萄球菌（Staphylococcus aureus）最不可能產生下列那種酵素？
A. 玻尿酸酶（Hyaluronidase）
B. 纖溶酶（Fibrinolysin）
C. 凝固酶（Coagulase）
D. C5a 蛋白酶（C5a peptidase）

正確答案：D. C5a 蛋白酶（C5a peptidase）